眼球的血管層（vascular tunica）不包含下列何種結構？
A. 虹彩（iris）
B. 水晶體（lens）
C. 睫狀體（ciliary body）
D. 脈絡層（choroid）

正確答案：B. 水晶體（lens）